病人因突發頭痛、心悸、冒冷汗而住院，檢查發現病人血壓變化很大，而這些症狀均合併血壓急速升高時發生，則他最可能的診斷是：
A. renovascular hypertension
B. primary aldosteronism
C. pheochromocytoma
D. coarctation of aorta

正確答案：C. pheochromocytoma